What is the chemical structure of Etanercept (ETN)?

Etanercept (ETN) is a soluble fusion protein of the tumor necrosis factor receptor (TNFR) extracellular domain, linked to an Fc part of IgG1. It possesses three N- and 13 O-glycosylation sites. Etanercept has the ability to bind to TNF-α and TGF-β, and thus is a potential novel therapeutic option for the treatment of cancer.